DSM-5 diagnosis of insomnia

The above is a clinical trial inclusion criterion. Annotated with entity spans:
[Qualifier: DSM-5] diagnosis of [Condition: insomnia]